Clinical trial inclusion criterion:
Signed study-specific consent form

Annotated entities:
- Informed_consent: "Signed study-specific consent form"